Clinical trial inclusion criterion:
Patients must be over 65 years old.

Annotated entities:
- Person: "old"
- Value: "over 65 years"